Clinical trial exclusion criterion:
Concomitant chronic inflammatory diseases on any ocular structure

Entity relations:
- Has_qualifier("chronic inflammatory diseases", "ocular structure")
- Has_temporal("chronic inflammatory diseases", "Concomitant")